Clinical trial exclusion criterion:
History of rhegmatogenous retinal detachment, retinal tear(s), or traction retinal detachments in the study eye.

Entity relations:
- Has_temporal("rhegmatogenous retinal detachment", "History of")
- Has_qualifier("rhegmatogenous retinal detachment", "in the study eye")
- OR("rhegmatogenous retinal detachment", "traction retinal detachments", "retinal tear(s)")